Clinical trial exclusion criterion:
Has had prior systemic therapy for HCC in the advanced (incurable) setting other than sorafenib or oxaliplatin-based chemotherapy, prior to start of study medication

Annotated entities:
- Procedure: "systemic therapy"
- Condition: "HCC"
- Drug: "sorafenib"
- Drug: "oxaliplatin"
- Procedure: "chemotherapy"
- Qualifier: "sorafenib or oxaliplatin-based"
- Temporal: "prior"
- Reference_point: "start of study medication"
- Negation: "other than"